Professional drivers, risk profession or respiratory failure.

The above is a clinical trial exclusion criterion. Annotated with entity spans:
[Person: Professional drivers], [Person: risk profession] or [Condition: respiratory failure].